Patients with a known allergy to ketamine or etomidate.

The above is a clinical trial exclusion criterion. Annotated with entity spans:
Patients with a known [Condition: allergy] to [Drug: ketamine] or [Drug: etomidate].